Es un oncogen:
1. NF1.
2. P53.
3. RB.
4. cMYC.
5. WT1.

Respuesta correcta: 4. cMYC.